Clinical trial inclusion criterion:
Women with recently diagnosed breast cancer and who will receive NAC to reduce tumor burden before surgery. (including locally advanced breast cancer (LABC) according to clinical assessment; or tumor size > 2cm, that is, at least T2 in TNM staging).

Annotated entities:
- Person: "Women"
- Condition: "breast cancer"
- Procedure: "NAC"
- Qualifier: "reduce tumor burden"
- Temporal: "before surgery"
- Reference_point: "surgery"